participant is willing to follow all study procedures; especially randomized antiplatelet treatment regimen and follow-up visits with transesophageal echocardiography when applicable

The above is a clinical trial inclusion criterion. Annotated with entity spans:
[Post-eligibility: participant is willing to follow all study procedures; especially randomized antiplatelet treatment regimen and follow-up visits with transesophageal echocardiography when applicable]